Death expected within the next 48 h (moribund patients as defined by ASA = class V)

The above is a clinical trial exclusion criterion. Annotated with entity spans:
[Observation: Death expected] [Temporal: within the next 48 h] ([Condition: moribund] patients as defined by [Measurement: ASA] [Value: = class V])